炭疽桿菌edema factor、霍亂毒素及百日咳毒素，有何共同處？
A. 都抑制寄主細胞的蛋白質合成
B. "可導致細胞內cAMP濃度增高"
C. 有脂肪酵素活性（phospholipase C），可以溶化細胞膜
D. 都能引起寄主腹瀉（diarrhea）

正確答案：B. "可導致細胞內cAMP濃度增高"